女性次發性性腺功能低下症（secondary hypogonadism）患者之卵巢無法排卵，是由於缺乏下列那種荷爾蒙？
A. 生長激素（GH）
B. 促黃體素（LH）
C. 甲促素（TSH）
D. 泌乳激素（prolactin）

正確答案：B. 促黃體素（LH）